9. Serum creatinine above ULN

The above is a clinical trial exclusion criterion. Annotated with entity spans:
[Parsing_Error: 9.] [Measurement: Serum creatinine] [Value: above ULN]